Clinical trial inclusion criterion:
DSM-IV-TR major depressive disorder

Entity relations:
- Has_qualifier("major depressive disorder", "DSM-IV-TR")